Un microelectrodo se caracteriza por:
1. Dar respuestas en estado estacionario.
2. Necesitar siempre un electrolito inerte.
3. Necesitar siempre un sistema potenciostático.
4. No necesitar electrodo de referencia.
5. Necesitar siempre agitación.

Respuesta correcta: 1. Dar respuestas en estado estacionario.